En la síntesis hepática de metionina a partir de homocisteína se requiere:
1. N5,N10 metenil-tetrahidrofolato.
2. N10-formil-tetrahidrofolato.
3. N5-formimino-tetrahidrofolato.
4. N5-metil-tetrahidrofolato.
5. N5,N10 metileno-tetrahidrofolato.

Respuesta correcta: 4. N5-metil-tetrahidrofolato.